Clinical trial inclusion criterion:
Age 1-59 months,

Annotated entities:
- Person: "Age"
- Value: "1-59 months"